Clinical trial exclusion criterion:
Lack of appetite that results in significant unintentional weight loss as determined by the study physician in the last three months

Annotated entities:
- Condition: "unintentional weight loss"
- Qualifier: "significant"
- Undefined_semantics: "significant"
- Condition: "Lack of appetite"
- Qualifier: "as determined by the study physician"
- Temporal: "in the last three months"